Clinical trial exclusion criterion:
Neovascularization > 0.75 mm in from of the limbus

Annotated entities:
- Condition: "Neovascularization"
- Value: "> 0.75 mm in from of the limbus"